Cuál de las siguientes enzimas NO participa en la glucólisis:
1. Gliceraldehído-3-fosfato-deshidrogenasa.
2. Piruvato carboxilasa.
3. Hexoquinasa.
4. Piruvato quinasa.

Respuesta correcta: 2. Piruvato carboxilasa.